Clinical trial exclusion criterion:
Cervical dilation >1.5 cm and/or visible membranes by pelvic exam

Annotated entities:
- Measurement: "Cervical dilation"
- Value: ">1.5 cm"
- Condition: "visible membranes"
- Procedure: "pelvic exam"